關於廣泛性焦慮症（generalized anxiety disorder）的治療，下列敘述何者錯誤？
A. 苯二氮平類藥物（benzodiazepine; BZD）是初診的首選藥物，可以迅速控制病情
B. 鹽酸丁螺環酮（buspirone）需服用2~3週才會出現藥效，對於認知（cognitive）症狀的療效優於身體（somatic）症狀
C. 最有效的治療是合併心理治療、藥物治療及支持性治療
D. 研究顯示認知行為治療（cognitive-behavioral technique）具有短期與長期之療效

正確答案：A. 苯二氮平類藥物（benzodiazepine; BZD）是初診的首選藥物，可以迅速控制病情